一個血型 O 型之婦女，第一胎足月產下血型 A 型之嬰兒，該嬰兒血比容（hematocrit）為 55%，且 小時大時血清膽色素（bilirubin）為 12 mg/dL，下列那項實驗數據最不符合 ABO 溶血性疾病？
A. 血液抹片有球型紅血球
B. 血液抹片有有核紅血球
C. 直接 Coombs 試驗（direct Coombs test）陰性
D. 血液網狀紅血球（reticulocyte）增加

正確答案：C. 直接 Coombs 試驗（direct Coombs test）陰性